5. Positive test for any drug included in the urine drug screen.

The above is a clinical trial exclusion criterion. Annotated with entity spans:
[Parsing_Error: 5.] [Context_Error: Positive test for any drug included in the urine drug screen.]